Availability to go to each revision when indicated.

The above is a clinical trial inclusion criterion. Annotated with entity spans:
[Post-eligibility: Availability to go to each revision when indicated.]